BMI >27 to 45

The above is a clinical trial inclusion criterion. Annotated with entity spans:
[Person: BMI] [Value: >27 to 45]